Clinical trial exclusion criterion:
Concurrent antibiotherapy

Entity relations:
- Has_temporal("antibiotherapy", "Concurrent")